Clinical trial exclusion criterion:
History of renal insufficiency or failure

Entity relations:
- OR("renal insufficiency", "renal failure")